30歲男性，背負50公斤沙袋跑完100公尺後，發現嚴重腰痛，合併右下肢後側傳至腳底的麻痛感，最有可能的診斷為何？
A. 帶狀皰疹神經炎（herpes zoster neuritis）
B. Guillain-Barré 症候群（Guillain-Barré syndrome）
C. 多發性肌炎（polymyositis）
D. 腰椎椎間盤突出（herniation of intervertebral disc）

正確答案：D. 腰椎椎間盤突出（herniation of intervertebral disc）